Clinical trial exclusion criterion:
Inpatient procedures for active GI bleeding

Entity relations:
- AND("Inpatient procedures", "GI bleeding")
- Has_qualifier("GI bleeding", "active")